Advanced renal impairment

The above is a clinical trial exclusion criterion. Annotated with entity spans:
[Condition: Advanced renal impairment]